are under 19 years old

The above is a clinical trial exclusion criterion. Annotated with entity spans:
are [Value: under 19 years] [Person: old]